膽囊（gallbladder）的內襯上皮屬於下列何者？
A. 移形上皮（transitional epithelium）
B. 單層柱狀上皮（simple columnar epithelium）
C. 複層柱狀上皮（stratified columnar epithelium）
D. 角質化複層扁平上皮（keratinized stratified squamous epithelium）

正確答案：B. 單層柱狀上皮（simple columnar epithelium）